History or presence of hypersensitivity or idiosyncratic reaction to deferiprone or deferoxamine;

The above is a clinical trial exclusion criterion. Annotated with entity spans:
History or presence of [Condition: hypersensitivity] or [Condition: idiosyncratic reaction] to [Drug: deferiprone] or [Drug: deferoxamine];